Clinical trial inclusion criterion:
Hb A1c 7.0-10.0%

Annotated entities:
- Measurement: "Hb A1c"
- Value: "7.0-10.0%"